For which type of cancer can uc.189 be used as a potential prognostic biomarker?

High expression of uc.189 might reflect poor prognosis of Esophageal squamous cell carcinomas (ESCC) and indicate a potential diagnostic target in ESCC patients. Uc.189 might be considered as a novel molecule involved in ESCC progression, which provides a potential prognostic biomarker and therapeutic target.